Clinical trial exclusion criterion:
Concomitant treatment with any other anticancer therapy.

Entity relations:
- Has_qualifier("anticancer therapy", "any other")
- AND("treatment", "anticancer therapy")
- Has_temporal("treatment", "Concomitant")